The existence of scar or fibrosis area constituting =50% of total lesion area

The above is a clinical trial exclusion criterion. Annotated with entity spans:
The existence of [Measurement: scar] or [Measurement: fibrosis area] constituting [Value: =50% of total lesion area]